懷疑 Asherman's 症候群，那項檢查最適當？
A. 血中雌激素濃度
B. 黃體素刺激試驗（progesterone challenge test）
C. Gn RH 試驗
D. TSH 試驗

正確答案：B. 黃體素刺激試驗（progesterone challenge test）